有關影響治療先天性膽道閉鎖症（biliary atresia）的預後因素，下列何者除外？
A. 手術矯治的年齡
B. 術後膽道炎（cholangitis）發生的頻率
C. 手術時肝臟纖維化的程度
D. 病人的血型

正確答案：D. 病人的血型